Which proteins have been identified as RET ligands?

The RET proto-oncogene encodes a receptor tyrosine kinase, which is activated by members of the glial cell line-derived neurotrophic factor (GDNF) family of ligands, which include GDNF, neurturin (NRTN), artemin (ARTN), and persephin (PSPN).